下列那一項是手足口病與其他出疹性疾病的鑑別診斷要點之一？
A. 手足口病的疹子直徑通常超過 1 公分
B. 手足口病患者的牙齦大多有浮腫發炎現象
C. 手足口病常於臀部出現疹子
D. 手足口病常合併發生結膜炎

正確答案：C. 手足口病常於臀部出現疹子